Clinical trial inclusion criteria:
Pregnant women between 34-42 weeks gestation
Singleton fetus
Admitted for labor management & develops a fever of 100.4 F or greater

Annotated entities:
- Condition: "Pregnant"
- Person: "women"
- Value: "between 34-42 weeks"
- Measurement: "gestation"
- Condition: "Singleton fetus"
- Procedure: "labor management"
- Mood: "Admitted for"
- Measurement: "fever"
- Value: "100.4 F or greater"